What cellular process is the gene product of NANOG involved in?

NANOG is a transcription factor and a biomarker of cancer and pluripotent stem cells.